有一位 45 歲女性，在 3 年前自己發現有右手抖動的情形，但是在吃飯夾菜的時候抖動就會停止。3 年來，抖動的時間與幅度似乎有比較厲害，但是也只侷限在右手，走路的速度與手的擺動與以往也沒有太多的差別，她沒有甲狀腺亢進之病史。發病之前兩年，左多巴胺的效果都還不錯，但最近已無法完全讓她不抖了。請問這種顫抖，最有可能的是：
A. 原發性顫抖（essential tremor）
B. 巴金森顫抖（parkinsonian tremor）
C. 原發性肌張力不全（primary dystonia）
D. 小腦萎縮症（cerebellar degeneration）

正確答案：B. 巴金森顫抖（parkinsonian tremor）